Clinical trial exclusion criterion:
Pregnancy: Women who are pregnant or lactating.

Annotated entities:
- Pregnancy_considerations: "Pregnancy: Women who are pregnant or lactating."